一年輕學生因車禍受傷，造成腓骨頸（neck of fibula）骨折，導致經過此處的神經受傷，下列那一功能最可能因此受到影響？
A. 膝關節伸直（extension of knee）
B. 膝關節屈曲（flexion of knee）
C. 髁關節屈曲（plantarflexion of ankle）
D. 髁關節背屈（dorsiflexion of ankle）

正確答案：D. 髁關節背屈（dorsiflexion of ankle）